Clinical trial exclusion criteria:
adults 61 years old and above
smokers
pregnant women
taking any prescription pain/ insulin medication
has a history of taste or smell loss or other oral disorders (e.g., burning mouth syndrome)
has current oral lesions, canker sores, or piercings
has a history of food allergy

Annotated entities:
- Person: "adults"
- Value: "and above 61 years"
- Person: "old"
- Observation: "smokers"
- Person: "women"
- Condition: "pregnant"
- Drug: "prescription insulin medication"
- Drug: "prescription pain medication"
- Temporal: "history"
- Condition: "smell loss"
- Condition: "taste loss"
- Qualifier: "other"
- Condition: "oral disorders"
- Condition: "burning mouth syndrome"
- Temporal: "current"
- Condition: "oral lesions"
- Condition: "canker sores"
- Device: "piercings"
- Temporal: "history"
- Condition: "food allergy"